What do nerve-associated peripheral glial progenitors give rise to?

Parasympathetic neurons originate from nerve-associated peripheral glial progenitors.